Osteoporosis or major risk for bone fractures.

The above is a clinical trial exclusion criterion. Annotated with entity spans:
[Condition: Osteoporosis] or [Mood: major risk] for [Condition: bone fractures].